闌尾炎術後最常發生的併發症為何？
A. 肺炎
B. 尿道感染
C. 腸皮下瘻管
D. 皮下和腹腔內的感染

正確答案：D. 皮下和腹腔內的感染